小明是一位 28 週早產兒，出生體重 1200 公克，出生後罹患呼吸窘迫症候群。目前針對此病症最有效之藥物為：
A. 類固醇
B. 阿斯匹林
C. 肺泡表面張力素
D. 抗生素

正確答案：C. 肺泡表面張力素